Las estatinas se emplean para reducir los niveles de colesterol y actúan como análogos del estado de transición de una enzima implicada en su biosíntesis. ¿De qué enzima se trata?
1. 14-Alfa-desmetilasa.
2. Hidroximetilglutaril coenzima A (HMGCoA) reductasa.
3. Ciclooxigenasa 2 (COX-2).
4. Escualeno epoxidasa.
5. Aromatasa.

Respuesta correcta: 2. Hidroximetilglutaril coenzima A (HMGCoA) reductasa.